Clinical trial inclusion criteria:
=18-40 year old women
BV+ by Amsel criteria and Nugent score OR history of BV in the prior 6 months
Willing to use the NuvaRing as directed
Not intending or wishing to become pregnant over the course of the study
Capable of providing written informed consent

Annotated entities:
- Person: "women"
- Person: "old"
- Value: "18-40 year"
- Measurement: "Amsel criteria"
- Measurement: "Nugent score"
- Value: "BV+"
- Condition: "BV"
- Condition: "BV"
- Temporal: "in the prior 6 months"
- Observation: "Willing to use"
- Drug: "NuvaRing"
- Pregnancy_considerations: "Not intending or wishing to become pregnant over the course of the study"
- Observation: "written informed consent"
- Observation: "Capable of providing written informed consent"